Clinical trial exclusion criterion:
Signs of life-threatening cerebral edema or multi-organ failure upon presentation to the emergency room or pediatric intensive care unit

Entity relations:
- Has_qualifier("cerebral edema", "life-threatening")
- Has_mood("cerebral edema", "Signs of")
- multi("presentation to the emergency room or pediatric intensive care unit", "emergency room")
- Has_index("upon presentation to the emergency room or pediatric intensive care unit", "presentation to the emergency room or pediatric intensive care unit")
- Has_temporal("cerebral edema", "upon presentation to the emergency room or pediatric intensive care unit")
- OR("cerebral edema", "multi-organ failure")
- OR("emergency room", "pediatric intensive care unit")